Body weight <50 or >120 kg

The above is a clinical trial exclusion criterion. Annotated with entity spans:
[Condition: Body weight] [Value: <50] or [Value: >120 kg]